Clinical trial exclusion criteria:
COPD exacerbation, very severe COPD with hypoxemia at low altitude (FEV1/FVC <0.7, FEV1 <40% predicted, oxygen saturation on room air <92% at 750 m).
Comorbidities such as uncontrolled cardiovascular disease, i.e., unstable systemic arterial hypertension, coronary artery disease; previous stroke; OSA; pneumothorax in the last 2 months.
Internal, neurologic, rheumatologic or psychiatric disease including current heavy smoking (>20 cigarettes per day)
Known renal failure or allergy to acetazolamide and other sulfonamides

Annotated entities:
- Condition: "COPD exacerbation"
- Condition: "COPD"
- Qualifier: "very severe"
- Condition: "hypoxemia"
- Qualifier: "low altitude"
- Measurement: "FEV1/FVC"
- Value: "<0.7"
- Measurement: "FEV1"
- Value: "<40% predicted"
- Measurement: "oxygen saturation"
- Qualifier: "room air"
- Value: "<92% at 750 m"
- Condition: "Comorbidities"
- Condition: "cardiovascular disease"
- Qualifier: "uncontrolled"
- Condition: "systemic arterial hypertension"
- Qualifier: "unstable"
- Condition: "coronary artery disease"
- Condition: "stroke"
- Qualifier: "previous"
- Condition: "OSA"
- Condition: "pneumothorax"
- Temporal: "in the last 2 months"
- Condition: "psychiatric disease"
- Condition: "rheumatologic disease"
- Condition: "neurologic disease"
- Condition: "Internal disease"
- Observation: "heavy smoking"
- Multiplier: ">20 cigarettes per day"
- Condition: "renal failure"
- Condition: "allergy"
- Drug: "acetazolamide"
- Drug: "sulfonamides"